Clinical trial exclusion criterion:
History of morphine allergy

Entity relations:
- AND("allergy", "morphine")
- Has_temporal("allergy", "History")